El estado de adaptación caracterizado por la diminución de la respuesta a la misma cantidad de droga o por la necesidad de una dosis mayor para provocar el mismo grado de efecto farmacológico, define:
1. La adaptación a una droga.
2. La vía de administración.
3. La intoxicación.
4. La tolerancia a una droga.
5. La conducta adictiva.

Respuesta correcta: 4. La tolerancia a una droga.